Ability to understand and sign informed consent.

The above is a clinical trial inclusion criterion. Annotated with entity spans:
[Post-eligibility: Ability to understand and sign informed consent.]